下列有關呼吸道細胞融合病毒（Respiratory syncytial virus）之敘述，何者正確？
A. 屬於正黏液病毒（Orthomyxovirus）
B. 侵入呼吸道後會引起支氣管上皮細胞壞死、黏液分泌、發炎細胞浸潤、黏膜下層水腫
C. 感染後可終身免疫
D. 核酸為正股 RNA

正確答案：B. 侵入呼吸道後會引起支氣管上皮細胞壞死、黏液分泌、發炎細胞浸潤、黏膜下層水腫